Clinical trial inclusion criteria:
Meibomian Gland Dysfunction
Eligible for heat treatment
Ocular Surface Disease Index (OSDI) >12
Quality or expressibility score =20 years old: >1 or >20 years old: =1
Non-invasive tear film break-up time (NITBUT) <10 s in at least one eye
Schirmer-1 test >5 mm after 5 min

Annotated entities:
- Condition: "Meibomian Gland Dysfunction"
- Mood: "Eligible for"
- Procedure: "heat treatment"
- Measurement: "Ocular Surface Disease Index"
- Measurement: "OSDI"
- Value: ">12"
- Measurement: "score Quality"
- Measurement: "expressibility score"
- Non-representable: "Quality or expressibility score =20 years old: >1 or >20 years old: =1"
- Measurement: "Non-invasive tear film break-up time (NITBUT)"
- Value: "<10 s"
- Multiplier: "at least one"
- Qualifier: "eye"
- Measurement: "Schirmer-1 test"
- Value: ">5 mm"
- Temporal: "after 5 min"